Clinical trial exclusion criterion:
Known hypersensitivity to any of the components of the solution

Entity relations:
- AND("hypersensitivity", "components of the solution")